Clinical trial exclusion criterion:
4. Any recent, significant change in dietary or exercise habits.

Annotated entities:
- Non-query-able: "Any recent, significant change in dietary or exercise habits."
- Parsing_Error: "4."